Which mRNAs are sequestered in stress granules?

Stress granules are higher order assemblies of nontranslating mRNAs and proteins that form when translation initiation is inhibited. 
This subset of mRNAs is characterized by extended length and adenylate-uridylate (AU)-rich motifs, is highly enriched with genes critical for cell survival and proliferation. mRNA accumulation in stress granules correlates with longer coding and UTR regions and poor translatability